切除轉移性肺腫瘤，下列敘述何項錯誤？
A. 原發性腫瘤沒有復發情況下，才會進行肺轉移腫瘤切除
B. 內視鏡手術切除轉移肺腫瘤已是標準手術方式
C. 可減少腫瘤負擔（tumor burden）
D. 手術前胸部的MRI不一定需要

正確答案：B. 內視鏡手術切除轉移肺腫瘤已是標準手術方式